Exposure to more than 4 investigational medicinal products within 12 months prior to the first dosing day.

The above is a clinical trial exclusion criterion. Annotated with entity spans:
Exposure to [Multiplier: more than 4] [Drug: investigational medicinal products] [Temporal: within 12 months prior to the first dosing day].